Clinical trial inclusion criterion:
Blasts < 1,000/µL in PB on day 8

Entity relations:
- AND("Blasts", "PB")
- Has_value("Blasts", "< 1,000/µL")
- Has_temporal("Blasts", "on day 8")